Clinical trial inclusion criterion:
A priori access must be right or left radial artery.

Entity relations:
- Has_qualifier("access", "priori")
- Has_qualifier("access", "right radial artery")
- OR("right radial artery", "left radial artery")